Clinical trial inclusion criterion:
Presents to the Emergency Department (ED) and meets the clinical definition for Acute Bacterial Skin and Skin Structure Infections (ABSSSI)

Entity relations:
- Subsumes("Acute Bacterial Skin and Skin Structure Infections", "ABSSSI")